Clinical trial exclusion criterion:
Prior therapy with SYK inhibitors.

Annotated entities:
- Drug: "SYK inhibitors"
- Procedure: "therapy"
- Temporal: "Prior"